Clinical trial exclusion criterion:
Nitroglycerin usage or nitrates and use of phosphodiesterase 5 (PDE5) inhibitors

Annotated entities:
- Drug: "Nitroglycerin"
- Drug: "nitrates"
- Drug: "phosphodiesterase 5 (PDE5) inhibitors"